世界醫學會所制定的赫爾辛基宣言（Declaration of Helsinki）中，對人體研究中的每一個研究對象，必須被告知以下那些內容？①研究的目的、方法 ②經費來源、任何可能的利益衝突 ③研究人員所屬機構 ④該研究可預見的益處，及可能伴隨的危險與不適 ⑤其擁有的權利，包括可拒絕參與研究，或可隨時撤回同意而不受報復
A. 只有①③④⑤
B. 只有①④⑤
C. 只有①③④
D. ①②③④⑤

正確答案：D. ①②③④⑤